Clinical trial exclusion criterion:
Any clinically significant acute or chronic medical condition requiring care by a primary care provider (e.g., diabetes, coronary artery disease, rheumatologic illness, malignancy, substance abuse) that, in the opinion of the investigator, would preclude participation

Annotated entities:
- Condition: "diabetes"
- Condition: "coronary artery disease"
- Condition: "rheumatologic illness"
- Condition: "malignancy"
- Condition: "substance abuse"